Clinical trial inclusion criterion:
Positive Fortin Finger Test (PMT)

Entity relations:
- Has_value("Fortin Finger Test (PMT)", "Positive")